Clinical trial inclusion criterion:
Age 18 to 65.

Annotated entities:
- Person: "Age"
- Value: "18 to 65"